Clinical trial exclusion criterion:
Depressed kidney function and/or AKI

Entity relations:
- Has_value("kidney function", "Depressed")
- multi("Depressed kidney function", "kidney function")
- OR("Depressed kidney function", "AKI")